Triglycerides =500 mg/dL

The above is a clinical trial exclusion criterion. Annotated with entity spans:
[Measurement: Triglycerides] [Value: =500 mg/dL]